Clinical trial exclusion criterion:
Actively wheezing at time of enrollment or history of asthma complications

Entity relations:
- Has_temporal("wheezing", "at time of enrollment")
- Has_index("at time of enrollment", "enrollment")
- OR("wheezing", "asthma complications")